Clinical trial exclusion criterion:
History of bilateral severe renal artery stenosis and 7) History of angioedema related to previous ACE-inhibitor treatment or known hypersensitivity to ramipril or other ACE inhibitors.

Entity relations:
- Has_qualifier("renal artery stenosis", "severe")
- Has_qualifier("renal artery stenosis", "bilateral")
- multi("ACE-inhibitor treatment", "ACE-inhibitor")
- AND("hypersensitivity", "ramipril")
- Has_qualifier("hypersensitivity", "known")
- Has_temporal("ACE-inhibitor treatment", "previous")
- AND("angioedema", "ACE-inhibitor treatment")
- Has_temporal("angioedema", "History")
- Has_temporal("renal artery stenosis", "History")
- OR("ramipril", "ACE inhibitors")
- OR("ACE-inhibitor treatment", "hypersensitivity")
- OR("renal artery stenosis", "angioedema")